Adolescente de 16 años que consulta por amenorrea primaria. No posee antecedentes medicoquirúrgicos de interés. A la exploración física encontramos caracteres sexuales secundarios femeninos, genitales externos femeninos, con un desarrollo mamario estadio III-IV, escaso vello púbico y axilar. Presenta una estatura en el percentil 90 para su edad. La radiografía simple revela una edad ósea de 15.8 años. El estudio analítico revela un estradiol de 50 pg/ml, y unas gonadotropinas elevadas. ¿Cuál de las siguientes entidades clínicas sería compatible con el diagnóstico?
1. Síndrome de Klinefelter.
2. Síndrome de Kallman.
3. Retraso constitucional del crecimiento.
4. Hiperplasia suprarrenal congénita.
5. Síndrome de insensibilidad androgénica completo.

Respuesta correcta: 5. Síndrome de insensibilidad androgénica completo.